List the classical triad of symptoms of the Melkersson–Rosenthal syndrome.

The Melkersson-Rosenthal syndrome consists of the classical triad of symptoms:
1) orofacial oedema 
2) fissured tongue (lingua plicata) and
3) facial paralysis.